Foveal subretinal fluid (SRF), on optical coherence tomography (OCT), at Baseline Examination;

The above is a clinical trial inclusion criterion. Annotated with entity spans:
[Condition: Foveal subretinal fluid (SRF)], on [Procedure: optical coherence tomography (OCT)], [Temporal: at Baseline Examination];